Clinical trial inclusion criterion:
Advanced hormone-dependent prostate cancer without any other clinically significant disorder

Entity relations:
- Has_qualifier("prostate cancer", "hormone-dependent")
- Has_qualifier("prostate cancer", "Advanced")